Tetrabenazine

The above is a clinical trial exclusion criterion. Annotated with entity spans:
[Drug: Tetrabenazine]